Clinical trial exclusion criterion:
Active malignant (p.e. any kind of cancer) or treated disease, to which the individual may relapse during the study;

Annotated entities:
- Condition: "malignant disease"
- Temporal: "Active"
- Condition: "cancer"
- Qualifier: "any kind"
- Condition: "treated disease"
- Procedure: "treated"
- Qualifier: "treated"
- Qualifier: "malignant"
- Subjective_judgement: "to which the individual may relapse during the study"
- Undefined_semantics: "to which the individual may relapse during the study"
- Non-query-able: "to which the individual may relapse during the study"
- Qualifier: "to which the individual may relapse"
- Temporal: "during the study"
- Reference_point: "the study"